蝕骨細胞（osteoclast） 主要是由下列何種細胞分化而來？
A. Monocyte
B. Neutrophil
C. Basophil
D. T lymphocyte

正確答案：A. Monocyte